Clinical trial exclusion criterion:
6. Known history of alpha-1-Antitrypsin deficiency

Annotated entities:
- Parsing_Error: "6."
- Condition: "alpha-1-Antitrypsin deficiency"
- Temporal: "history"